Respecto al sentido de la vista en los bebes nacidos ¿Qué afirmación es cierta?:
1. Los bebés nacen prácticamente ciegos.
2. Los bebés enfocan coordinadamente los dos ojos (visión bionocular) desde el nacimiento.
3. De los cinco sentidos, el de la vista es el menos maduro en el momento del nacimiento.
4. Los bebés tienen especiales problemas para enfocar objetos que están entre 6 y 75 cm.

Respuesta correcta: 3. De los cinco sentidos, el de la vista es el menos maduro en el momento del nacimiento.